Non-ambulatory or 'exercise only' ambulators with or without assistive devices

The above is a clinical trial inclusion criterion. Annotated with entity spans:
[Observation: Non-ambulatory] or [Observation: 'exercise only' ambulators] with or without [Device: assistive devices]